Patients with known allergies to materials of bovine origin.

The above is a clinical trial exclusion criterion. Annotated with entity spans:
Patients with known [Condition: allergies] to [Drug: materials of bovine origin].